Clinical trial exclusion criterion:
Female parturient or nursing

Annotated entities:
- Person: "Female"
- Condition: "parturient"
- Condition: "nursing"